type 2 diabetes mellitus

The above is a clinical trial inclusion criterion. Annotated with entity spans:
[Condition: type 2 diabetes mellitus]